Had a nontuberculous mycobacterial infection or opportunistic infection within 6 months prior to Screening

The above is a clinical trial exclusion criterion. Annotated with entity spans:
Had a [Condition: nontuberculous mycobacterial infection] or [Condition: opportunistic infection] [Temporal: within 6 months prior to Screening]